Clinical trial inclusion criterion:
Established T2DM (=3months)

Entity relations:
- Has_temporal("T2DM", "=3months")